在先天性心臟病中，新生兒期發現後最罕見有機會自然癒合的為下列何者？
A. 膜邊型心室中隔缺損（perimembranous ventricular septal defect）
B. 第二口心房中隔缺損（secundum atrial septal defect）
C. 存開放性動脈幹（persistent truncus arteriosus）
D. 肌肉型心室中隔缺損（muscular ventricular septal defect）

正確答案：C. 存開放性動脈幹（persistent truncus arteriosus）